Indica cuál de los siguientes déficits da lugar a una porfiria:
1. Fenilalanina hidroxilasa.
2. 21-hidroxilasa.
3. ALA deshidratasa.
4. Glucoquinasa.
5. Tirosina hidroxilasa.

Respuesta correcta: 3. ALA deshidratasa.